Clinical trial inclusion criterion:
Inclusion Criteria Patients: Fulfilling the diagnostic criteria of schizophrenia or schizoaffective disorder according to ICD-10 (International Classification of Diseases version 10) or DSM-IV/V (Diagnostic and Statistical Manual version 4 /5), Age 18-45 years, Never treated with antipsychotic compounds or central nervous system (CNS) stimulants, Legally competent

Entity relations:
- Has_qualifier("schizophrenia", "ICD-10 (International Classification of Diseases version 10)")
- Has_value("Age", "18-45 years")
- Has_negation("antipsychotic compounds", "Never")
- Has_negation("central nervous system (CNS) stimulants", "Never")
- AND("Patients", "Age")
- AND("Patients", "antipsychotic compounds")
- AND("Patients", "central nervous system (CNS) stimulants")
- Has_context("Patients", "Legally competent")
- OR("schizophrenia", "schizoaffective disorder")
- OR("ICD-10 (International Classification of Diseases version 10)", "DSM-IV/V (Diagnostic and Statistical Manual version 4 /5)")